Clinical trial exclusion criterion:
St. John's wort

Annotated entities:
- Condition: "St. John's wort"